Clinical trial exclusion criterion:
diagnosed congenital long QT syndrome

Annotated entities:
- Condition: "congenital long QT syndrome"